下列何種濾泡（follicle）不具有透明帶（zona pellucida）？
A. 成熟濾泡（mature follicle）
B. 次級濾泡（secondary follicle）
C. 初級濾泡（primary follicle）
D. 原始濾泡（primordial follicle）

正確答案：D. 原始濾泡（primordial follicle）